Clinical trial inclusion criterion:
age 18 years or older

Annotated entities:
- Person: "age"
- Value: "18 years or older"